Clinical trial exclusion criterion:
Medication: Immunosuppressive drugs, antibiotics in the past three months (before baseline appointment) )

Annotated entities:
- Drug: "Immunosuppressive drugs"
- Drug: "antibiotics"
- Temporal: "in the past three months"
- Temporal: "before baseline appointment"
- Procedure: "baseline appointment"
- Reference_point: "baseline appointment"